Clinical trial exclusion criterion:
patient poor responders

Annotated entities:
- Condition: "poor responders"